Current drug and alcohol abuse.

The above is a clinical trial exclusion criterion. Annotated with entity spans:
Current [Condition: drug] and [Condition: alcohol abuse].